Clinical trial inclusion criterion:
New or presumed new significant ST-T wave changes

Entity relations:
- Has_qualifier("ST-T wave changes", "significant")
- Has_multiplier("ST-T wave changes", "New")
- OR("New", "presumed new")